Clinical trial inclusion criteria:
Undergoing abdominoplasty or TRAM flap breast reconstruction

Annotated entities:
- Procedure: "abdominoplasty"
- Procedure: "TRAM flap breast reconstruction"